El concepto de Evaluación del Potencial de Aprendizaje (PA) o Evaluación Dinámica (ED) trata de comprender el desarrollo cognitivo y el potencial de aprendizaje por medio de factores:
1. Biológicos.
2. Psicopatológicos.
3. Internos y lógicos.
4. Socioculturales.

Respuesta correcta: 4. Socioculturales.